FEV1/SVC>=70%

The above is a clinical trial exclusion criterion. Annotated with entity spans:
[Measurement: FEV1/SVC][Value: >=70%]